What is the use of pegcetacoplan?

Pegcetacoplan is promising for paroxysmal nocturnal haemoglobinuria and Geographic Atrophy.